Abnormal hepatic function (liver function test > twice the normal range), abnormal renal function (creatinine > 1.1 mg/dl), fasting plasma glucose in the diabetic range (>/= 126 mg/dl), or blood pressure > 140/90 mmHg.

The above is a clinical trial exclusion criterion. Annotated with entity spans:
[Value: Abnormal] [Measurement: hepatic function] ([Measurement: liver function test] [Value: > twice the normal range]), [Value: abnormal] [Measurement: renal function] ([Measurement: creatinine] [Value: > 1.1 mg/dl]), [Measurement: fasting plasma glucose] [Value: in the diabetic range] ([Value: >/= 126 mg/dl]), or [Measurement: blood pressure] [Value: > 140/90 mmHg].